Clinical trial inclusion criteria:
Are at least 18 years of age
Demonstrate a positive cough stress test during complex multi-channel urodynamic testing
Demonstrate impact of stress urinary incontinence on quality of life questionnaire
Are able to comprehend and sign a written informed consent
Understand and are willing to comply with the study requirements, including agreeing to be available for the follow-up evaluations
Are psychologically stable and suitable for interventions determined by the investigator
Are ambulatory and able to use a toilet independently

Annotated entities:
- Value: "at least 18 years"
- Person: "age"
- Measurement: "cough stress test"
- Value: "positive"
- Procedure: "complex multi-channel urodynamic testing"
- Condition: "stress urinary incontinence"
- Procedure: "quality of life questionnaire"
- Observation: "able to comprehend a written informed consent"
- Observation: "able to sign a written informed consent"
- Observation: "willing to comply with the study requirements"
- Observation: "Understand the study requirements"
- Condition: "psychologically stable"
- Condition: "suitable for interventions"
- Qualifier: "determined by the investigator"
- Condition: "ambulatory"
- Condition: "able to use a toilet independently"